The ability to produce a visible precision grip force with one hand

The above is a clinical trial inclusion criterion. Annotated with entity spans:
[Mood: The ability to] [Procedure: produce a visible precision grip force with one hand]